What is the role of elagolix in treatment of uterine fibroids?

Elagolix is approved for the treatment of moderate to severe pain caused by endometriosis. Elagolix is also effective for heavy bleeding caused by uterine fibroids.